下列何者藥品主要是抑制肥胖細胞（mast cells）釋放出組織胺，可用來預防運動誘導之氣管痙攣 （exercise-induced bronchospasm）作用？
A. cromolyn sodium
B. ipratropium
C. montelukast
D. zileuton

正確答案：A. cromolyn sodium